received interferon or peginterferon treatment in the past.

The above is a clinical trial exclusion criterion. Annotated with entity spans:
received [Drug: interferon] or [Drug: peginterferon] [Procedure: treatment] [Temporal: in the past].